Clinical trial exclusion criterion:
Unable or unwilling to comply with protocol requirements

Annotated entities:
- Post-eligibility: "Unable or unwilling to comply with protocol requirements"